Positive for at least one of the anti-islet autoantibodies: GADA, IA2A, ZnT8A

The above is a clinical trial inclusion criterion. Annotated with entity spans:
Positive for [Multiplier: at least one] of the [Condition: anti-islet autoantibodies]: [Condition: GADA], [Condition: IA2A], [Condition: ZnT8A]